gastric/duodenal ulcer

The above is a clinical trial exclusion criterion. Annotated with entity spans:
[Condition: gastric]/[Condition: duodenal ulcer]